Clinical trial exclusion criterion:
2. history of congestive heart failure, unstable cardiac arrhythmias, hypertrophic cardiomyopathy, severe aortic stenosis, angina or dyspnea at rest or during ADL's;

Annotated entities:
- Parsing_Error: "2."
- Temporal: "history"
- Condition: "congestive heart failure"
- Condition: "unstable cardiac arrhythmias"
- Condition: "hypertrophic cardiomyopathy"
- Condition: "severe aortic stenosis"
- Condition: "angina"
- Condition: "dyspnea at rest"
- Condition: "dyspnea during ADL's"